Which syndrome is caused by deletion of Pds5b in mice?

Mice lacking sister chromatid cohesion protein Pds5b exhibit developmental abnormalities reminiscent of Cornelia de Lange syndrome.